Patients receiving hemoporfin based upon the clinical judgment of the investigator;

The above is a clinical trial inclusion criterion. Annotated with entity spans:
Patients receiving [Drug: hemoporfin] based upon the clinical judgment of the investigator;